Platelet count greater than or equal to 40,000/mm^3

The above is a clinical trial inclusion criterion. Annotated with entity spans:
[Measurement: Platelet count] [Value: greater than or equal to 40,000/mm^3]